Clinical trial inclusion criterion:
= 2 mm ST-elevation in 2 contiguous inferior leads (II, III, aVF) for a minimum combined total of = 4 mm ST-elevation

Annotated entities:
- Non-query-able: "= 2 mm ST-elevation in 2 contiguous inferior leads (II, III, aVF) for a minimum combined total of = 4 mm ST-elevation"